List versions of ExpansionHunter

ExpansionHunter and ExpansionHunter Denovo